大腸桿菌（Escherichia coli）所引起各種不同型態的腹瀉症（diarrhea）主要取決於：
A. 共同感染的其他細菌之種類
B. 此菌的體表抗原性
C. 宿主的免疫力
D. 此菌所產生的毒力因素

正確答案：D. 此菌所產生的毒力因素